Clinical trial exclusion criterion:
Allergy to levetiracetam.

Entity relations:
- AND("Allergy", "levetiracetam")